Clinical trial exclusion criterion:
SGLT2 inhibitor, TZD, DPP4 inhibitor and GLP1 RA use within the past 6 months

Annotated entities:
- Drug: "SGLT2 inhibitor"
- Drug: "TZD"
- Drug: "DPP4 inhibitor"
- Drug: "GLP1 RA"
- Temporal: "within the past 6 months"